Scheduled for elective posterior lumbar spinal fusion surgery between 1 and 3 levels

The above is a clinical trial inclusion criterion. Annotated with entity spans:
[Mood: Scheduled for] [Qualifier: elective] [Procedure: posterior lumbar spinal fusion surgery] [Qualifier: between 1 and 3 levels]